Clinical trial inclusion criterion:
Use of a non-hormonal form of contraception, such as: sterilization (tubal ligation, Essure), copper IUD (intrauterine device), barrier methods or abstinence

Entity relations:
- Subsumes("sterilization", "tubal ligation")
- Subsumes("copper IUD", "intrauterine device")
- Subsumes("non-hormonal form of contraception", "sterilization")
- OR("tubal ligation", "Essure")
- OR("sterilization", "copper IUD", "barrier methods", "abstinence")